Clinical trial exclusion criterion:
The patient is pregnant or breastfeeding

Entity relations:
- OR("pregnant", "breastfeeding")